Clinical trial exclusion criterion:
Hypersensitivity to a PCC

Annotated entities:
- Condition: "Hypersensitivity"
- Drug: "PCC"